Explain amniotic band syndrome.

abs is an uncommon and heterogeneous congenital disorder caused by entrapment of fetal parts by fibrous amniotic bands, causing distinctive structural abnormalities involving limbs, trunk, and craniofacial regions. the incidence ranges between 1/1200 and 1/15,000 live births, but is higher in stillbirths and previable fetuses.